Clinical trial inclusion criterion:
Treated with conventional anti-depressant, administered within a formal psychiatric clinic or by a certified psychiatrist.

Annotated entities:
- Drug: "conventional anti-depressant"
- Procedure: "Treated"